Clinical trial exclusion criterion:
Inability to provide informed consent or to comply with study assessments (e.g. due to cognitive impairment or geographic distance).

Annotated entities:
- Post-eligibility: "Inability to provide informed consent or to comply with study assessments (e.g. due to cognitive impairment or geographic distance)."